Clinical trial exclusion criterion:
The patient is currently using or has used cannabinoid based medications within 90 days of study entry and is unwilling to abstain for the duration of the study

Entity relations:
- Has_temporal("cannabinoid based medications", "within 90 days of study entry")